5. Untreated urogenital infections (either symptomatic or asymptomatic) within 2 weeks prior to enrollment

The above is a clinical trial exclusion criterion. Annotated with entity spans:
5. [Qualifier: Untreated] [Condition: urogenital infections] (either [Condition: symptomatic] or [Condition: asymptomatic]) [Temporal: within 2 weeks prior to enrollment]